Previous malignancies within 2 yrs. unless relapse risk is small (< 5%).

The above is a clinical trial exclusion criterion. Annotated with entity spans:
Previous [Condition: malignancies] [Temporal: within 2 yrs.] [Non-query-able: unless relapse risk is small (< 5%)].